Un medicamento elaborado y garantizado por un farmacéutico, o bajo su dirección, dispensado en su oficina de farmacia o servicio farmacéutico, enumerado y descrito por el Formulario Nacional, y destinado a su entrega directa a los enfermos a los que abastece dicha farmacia o servicio farmacéutico es:
1. Fórmula magistral.
2. Preparado oficinal.
3. Medicamento prefabricado.
4. Producto intermedio.
5. Producto sanitario.

Respuesta correcta: 2. Preparado oficinal.